Chronic pain history

The above is a clinical trial exclusion criterion. Annotated with entity spans:
[Condition: Chronic pain] history